¿Qué grupo de aminoácidos, cuando forman parte de las proteínas, puede fosforilarse?
1. Val, Ser, Thr.
2. Phe, Ala, Gly.
3. Val, Glu, Asp.
4. Tyr, Ser, Thr.
5. Lys, Ser, Ile.

Respuesta correcta: 4. Tyr, Ser, Thr.